h/o stroke

The above is a clinical trial exclusion criterion. Annotated with entity spans:
h/o [Condition: stroke]